試管嬰兒療程中以controlled ovarian stimulation得以同時使多顆濾泡成熟至排卵前的階段，最主要是因為額外給予下列那一種荷爾蒙？
A. Estradiol，因為高雌性素的環境，能持續支持長大中的濾泡
B. FSH，因為高濃度的FSH，能持續支持長大中的濾泡
C. LH，因為LH會增加steroid製造，讓較小的濾泡持續有生成雌性素的原料
D. Estradiol，因為高濃度的雌性素會負回饋抑制下視丘，進而延遲LH surge讓更多濾泡可以生長

正確答案：B. FSH，因為高濃度的FSH，能持續支持長大中的濾泡